下列轉移性腦瘤的原發性癌，何者最少見？
A. 肺癌
B. 乳癌
C. 前列腺癌
D. 皮膚黑色素癌（skin, melanoma）

正確答案：C. 前列腺癌